下列何項是第 2 型糖尿病腎病變最早期的臨床表現？
A. 尿液白蛋白排泄量 >30 mg/day
B. 血清肌酸酐（creatinine）>1.2 mg/dL
C. 腎絲球過濾率 >120 mL/min
D. 血壓 >130/80 mmHg

正確答案：C. 腎絲球過濾率 >120 mL/min